下列何者不屬於荷爾蒙補充治療之禁忌症？
A. 不明原因的陰道出血（undiagnosed abnormal vaginal bleeding）
B. 子宮內膜癌（endometrial cancer）
C. 肺栓塞（pulmonary embolism）
D. 糖尿病（diabetes mellitus）

正確答案：D. 糖尿病（diabetes mellitus）